Clinical trial exclusion criterion:
6. Coronary vessels with tortuosity or extremely calcified

Entity relations:
- OR("Coronary vessel tortuosity", "Coronary vessel extremely calcified")